重組 Interleukin-2 蛋白質可以用來治療下列何種疾病？
A. 惡性黑色素細胞瘤
B. 風濕性關節炎
C. 膀胱癌
D. 牛皮癬

正確答案：A. 惡性黑色素細胞瘤